Clinical trial inclusion criterion:
20-70 yrs of age

Entity relations:
- Has_value("age", "20-70 yrs")